Clinical trial exclusion criterion:
autism spectrum disorder

Annotated entities:
- Condition: "autism spectrum disorder"